Clinical trial exclusion criterion:
(2)History of allergies to enalapril, folic acid or other components of the compound drug;

Annotated entities:
- Temporal: "History"
- Condition: "allergies"
- Drug: "enalapril"
- Drug: "folic acid"
- Drug: "components of the compound drug"